Clinical trial exclusion criterion:
Allergy to the vaccine compounds, as egg, neomycin and gelatin.

Annotated entities:
- Condition: "Allergy to the vaccine compounds"
- Drug: "vaccine compounds"
- Drug: "egg"
- Drug: "neomycin"
- Drug: "gelatin"